Clinical trial inclusion criterion:
2. Greater than the age of 18

Annotated entities:
- Parsing_Error: "2."
- Value: "Greater than 18"
- Person: "age"